Clinical trial exclusion criterion:
dysautonomia

Annotated entities:
- Condition: "dysautonomia"